Clinical trial exclusion criterion:
Persons with a history of severe allergic reaction after previous vaccinations or hypersensitivity to any seasonal influenza vaccine component

Annotated entities:
- Condition: "allergic reaction"
- Qualifier: "severe"
- Temporal: "history"
- Temporal: "after previous vaccinations"
- Reference_point: "previous vaccinations"
- Condition: "hypersensitivity to any seasonal influenza vaccine component"
- Drug: "seasonal influenza vaccine component"